Clinical trial exclusion criterion:
creatinine level of 1,5 mg/dL or more

Entity relations:
- Has_value("creatinine level", "1,5 mg/dL or more")